Clinical trial inclusion criterion:
Naïve cannabis patients with chronic non-cancer and cancer pain (not used cannabis in any presentation in the last 12 weeks)

Entity relations:
- Has_qualifier("pain", "non-cancer")
- Has_qualifier("pain", "chronic")
- Has_temporal("cannabis", "in the last 12 weeks")
- AND("cannabis", "not")
- Subsumes("Naïve cannabis", "cannabis")
- OR("non-cancer", "cancer")